Clinical trial inclusion criteria:
American Society of Anesthesiologist physical status 1-3
Scheduled for elective video-assisted thoracic surgery
Able to operate a patient-controlled analgesia device (PCA)

Annotated entities:
- Measurement: "American Society of Anesthesiologist physical status"
- Value: "1-3"
- Qualifier: "elective"
- Mood: "Scheduled for"
- Procedure: "video-assisted thoracic surgery"
- Device: "patient-controlled analgesia device"
- Device: "PCA"